Clinical trial exclusion criterion:
No legal ability or legal ability is limited.

Annotated entities:
- Post-eligibility: "No legal ability or legal ability is limited"